How many copies of TP53 does the elephant genome contain?

Here, we show that the elephant genome encodes 20 copies of the tumor suppressor gene TP53 and that the increase in TP53 copy number occurred coincident with the evolution of large body sizes, the emergence of extreme sensitivity to genotoxic stress, and a hyperactive TP53 signaling pathway.